Clinical trial inclusion criterion:
Patients who have taken more than one anti-TNFa agent

Entity relations:
- Has_multiplier("anti-TNFa agent", "more than one")